Clinical trial exclusion criterion:
9. Patients taking melatonin receptor agonists (such as Rozerem® [ramelteon]).

Annotated entities:
- Drug: "melatonin receptor agonists"
- Drug: "Rozerem"
- Drug: "ramelteon"